Clinical trial inclusion criterion:
Localized intermediate-risk or high-risk prostate cancer cT3

Entity relations:
- Has_qualifier("prostate cancer", "intermediate-risk")
- Has_qualifier("prostate cancer", "cT3")
- OR("intermediate-risk", "high-risk")